Prostate volume > 100 cc

The above is a clinical trial inclusion criterion. Annotated with entity spans:
[Measurement: Prostate volume] [Value: > 100 cc]